胰島素缺乏的第一型糖尿病（type I diabetes mellitus）病人，血糖控制極差時，可能發生酮酸中毒（ketoacidosis），下列有關病人體內能量代謝之敘述，何者錯誤？
A. 酮體（ketone body）主要是由葡萄糖代謝產生之 acetyl-CoA 所轉化而成
B. 酮體可代替葡萄糖成為細胞能量來源
C. Kreb's cycle 之中間產物，如 oxaloacetate 被移作糖質新生作用（gluconeogenesis）之材料，故血糖會上升
D. acetyl-CoA 因缺乏 oxaloacetate，無法進行 Kreb's cycle，故轉化成酮體

正確答案：A. 酮體（ketone body）主要是由葡萄糖代謝產生之 acetyl-CoA 所轉化而成